Liver biopsy within 2 years of Screening showing absence of cirrhosis

The above is a clinical trial inclusion criterion. Annotated with entity spans:
[Procedure: Liver biopsy] [Temporal: within 2 years of Screening] showing [Negation: absence] of [Condition: cirrhosis]